Clinical trial exclusion criteria:
Heart failure
Signs of kidney injury/failure
Severe allergies

Annotated entities:
- Condition: "Heart failure"
- Condition: "kidney injury"
- Condition: "kidney failure"
- Mood: "Signs of"
- Qualifier: "Severe"
- Condition: "allergies"